M. perstans mg-positive status Good general health without any clinical condition requiring long-term medication.

The above is a clinical trial inclusion criterion. Annotated with entity spans:
[Parsing_Error: M. perstans mg-positive status Good general health without any clinical condition requiring long-term medication.]